Clinical trial exclusion criterion:
BMI>40

Entity relations:
- Has_value("BMI", ">40")